14. Previous or current enrollment in a clinical trial to enhance motor recovery; 15) currently exercising ≥ 2 times per week (≥20 minutes);

The above is a clinical trial exclusion criterion. Annotated with entity spans:
[Parsing_Error: 14.] [Non-query-able: Previous or current enrollment in a clinical trial to enhance motor recovery; 15) currently exercising ≥ 2 times per week (≥20 minutes)];